1. Patient is over 18 years old.

The above is a clinical trial inclusion criterion. Annotated with entity spans:
1. Patient is [Value: over 18 years old].